A un hombre de 45 años de edad se le realiza una vagotomía troncular y antrectomía con recostrucción tipo Billroth II, por padecer una enfermedad ulcerosa péptica crónica con estenosis píloro-duodenal. Seis semanas después de la cirugía refiere que poco tiempo después (menos de media hora) de las ingestas presenta estado nauseoso, astenia y sudoración, mareos y retortijones abdominales generalmente acompañados de despeños diarreicos. ¿Cuál de las siguientes es la actitud más adecuada para su manejo inicial?
1. Aplicar tratamiento con un análogo de la somatostatina (octeótrido).
2. Seguir unas medidas dietéticas concretas.
3. Realizar un tratamiento de prueba con una benzodiacepina.
4. Realizar la búsqueda de un probable tumor neuroendocrino (p.ej.: carcinoide).
5. Indicar tratamiento quirúrgico para efectuar una gastro-yeyunostomía antiperistáltica en Y de Roux.

Respuesta correcta: 2. Seguir unas medidas dietéticas concretas.